What drug, used to treat rheumatoid arthritis, is an interleukin-1 receptor antagonist?

Anakinra is an anti-IL-1RA targeting IL-1β with a central role in the occurrence of auto-inflammatory diseases.